Sobre el metabolismo del etanol en el organismo, ¿cuál de las siguientes respuestas es cierta?:
1. En el intestino se absorbe mediante difusión pasiva.
2. Del intestino es transportado mayoritariamente al riñón, en donde es transformado en acetaldehído, el cual es eliminado a la orina.
3. La alcohol deshidrogenasa hepática lo transforma en acetato.
4. La alcohol deshidrogenasa hepática lo transforma en formaldehído y éste es transformado en acetato por la formaldehído deshidrogenasa.

Respuesta correcta: 1. En el intestino se absorbe mediante difusión pasiva.